What percentage of C. elegans genes reside in operons?

Our data indicate that 15% of the genes in C. elegans reside in operons.